Los dienos en que los dos enlaces π comparten un carbono de hibridación sp y son perpendiculares entre si se conocen como:
1. Dienos conjugados.
2. Dienos aislados.
3. Aromáticos.
4. Alenos.

Respuesta correcta: 4. Alenos.